Clinical trial exclusion criterion:
Established Osteoarthritis (Kellgren-Lawrence > 3)

Entity relations:
- Has_value("Kellgren-Lawrence", "> 3")